Clinical trial exclusion criterion:
MI within 6 mo and LVEF < 45%

Entity relations:
- Has_temporal("MI", "within 6 mo")
- Has_value("LVEF", "< 45%")